Clinical trial inclusion criterion:
Has a contact lens spherical prescription between + 2.25 to - 8.00 (inclusive)

Entity relations:
- Has_qualifier("contact lens", "spherical")
- Has_value("contact lens", "+ 2.25 to - 8.00 (inclusive)")